麻痺性斜視時，第二偏位（Secondary deviation）角度會大於第一偏位（Primary deviation），是因為下列那一項？
A. Donders 氏律
B. Duane 氏律
C. Hering 氏律
D. Sherrington 氏律

正確答案：C. Hering 氏律